黃體中期是否受孕會影響子宮內膜變化的臨界分歧點（Critical branch point），與下列何者有關？
A. 腫瘤壞死因子α（TNF α）
B. 轉型生長因子β（TGF β）
C. 間白素-1（IL-1）
D. 前列腺素 E2（PGE2）

正確答案：B. 轉型生長因子β（TGF β）